縱隔腔腫瘤最少發生於下列何處？
A. 前縱隔腔（anterior mediastinum）
B. 上縱隔腔（superior mediastinum）
C. 後縱隔腔（posterior mediastinum）
D. 中縱隔腔（middle mediastinum）

正確答案：D. 中縱隔腔（middle mediastinum）